Clinical trial exclusion criterion:
With immunosuppression (i.e. HIV, lymphoma)

Annotated entities:
- Condition: "HIV"
- Condition: "lymphoma"
- Observation: "immunosuppression"